Clinical trial exclusion criterion:
Heart attack, stroke, transient ischemic attack or acute congestive heart failure within 4 months

Annotated entities:
- Condition: "Heart attack"
- Condition: "stroke"
- Condition: "transient ischemic attack"
- Condition: "acute congestive heart failure"
- Temporal: "within 4 months"